一位病人血液氣體分析顯示pH 7.51，PaCO2 49 mmHg，HCO3- 38 mmol/L，下列何者正確？
A. 代謝性酸中毒（酸血症）
B. 代謝性鹼中毒
C. 呼吸性酸中毒
D. 呼吸性鹼中毒

正確答案：B. 代謝性鹼中毒